Clinical trial inclusion criterion:
Willing to follow the protocol

Annotated entities:
- Post-eligibility: "Willing to follow the protocol"